張先生 58 歲，患冠狀動脈心臟病及高血壓，目前服用下列藥物，今欲使用威而剛（sildenafil, viagra），則那一藥物應停止服用？
A. beta-blocker
B. calcium channel blocker
C. nitrate
D. angiotensin-converting enzyme inhibitor

正確答案：C. nitrate